Clinical trial exclusion criterion:
History of, or current, open head brain trauma. Candidates with any metal, shrapnel or other similar objects in the head that could affect the QEEG

Annotated entities:
- Condition: "open head brain trauma"
- Temporal: "current"
- Temporal: "History"
- Device: "metal"
- Device: "shrapnel"
- Device: "objects in the head"
- Procedure: "QEEG"
- Condition: "affect"